Clinical trial exclusion criterion:
inability to take oral medication.

Entity relations:
- Has_mood("oral medication", "inability")